Las balsas lipídicas son agregados de colesterol y:
1. Fosfolípidos.
2. Triacilglicéridos.
3. Esfingolípidos.
4. Ácidos grasos.

Respuesta correcta: 3. Esfingolípidos.